Pregnancy (Self-reported)

The above is a clinical trial exclusion criterion. Annotated with entity spans:
[Condition: Pregnancy] ([Non-query-able: Self-reported])